樹突細胞可以誘導調節性T細胞的分化，下列那個分子與此功能無直接關聯？
A. IL-10
B. TGF-β
C. Indoleamine 2, 3 dioxygenase（IDO）
D. IL-6

正確答案：D. IL-6